一位 86 歲男性，26 年前因雙側股骨頭缺血性壞死，做過雙側髖關節置換手術；20 年前因胃癌，做過部分胃切除手術。此外，還曾罹患過肺結核及做過腸阻塞手術等。病患長期虛弱臥床，發生過數次吸入性肺炎，亦有嚴重攝護腺肥大。此次病人再度發燒、喘、黃痰、少尿和肺囉音，懷疑尿路或肺部感染，使用廣效抗生素後，病情獲得控制。針對目前病史之臨床處置模式，符合下列那一種？
A. 以疾病為中心的診治模式
B. 以問題為中心的診治模式
C. 以病人為中心的診治模式
D. 以家庭為中心的診治模式

正確答案：B. 以問題為中心的診治模式